下列何者是引發裂孔型視網膜剝離（rhegmatogenous retinal detachment）較常見之原因？
A. 後玻璃體剝離
B. 玻璃體出血
C. 視網膜中心動脈阻塞
D. 背基型糖尿病視網膜病變

正確答案：A. 後玻璃體剝離